Clinical trial exclusion criterion:
Active smoking (within the past year)

Entity relations:
- Has_qualifier("smoking", "Active")
- Has_value("smoking", "within the past year")